What is the function of kisspeptin in the brain?

Kisspeptin is a neuropeptide that plays an integral role in the regulation of energy intake and reproduction by acting centrally on the hypothalamus-pituitary-gonadal axis. Kisspeptin also preserves mitochondrial function by inducing mitophagy and autophagy in aging rat brain.